Clinical trial inclusion criterion:
Be an experienced opioid user, defined as any subject treated with opioid therapy, equivalent or equal to >20 mg per day of morphine, for a period of 3 consecutive days immediately prior to first day of dosing.

Entity relations:
- Has_qualifier("morphine", "equivalent")
- Has_multiplier("morphine", ">20 mg per day")
- Has_multiplier("morphine", ">20 mg per day")
- Has_index("3 consecutive days immediately prior to first day of dosing", "first day of dosing")
- AND("opioid therapy", "morphine")
- Has_temporal("opioid therapy", "3 consecutive days immediately prior to first day of dosing")
- AND("opioid therapy", "morphine")